Clinical trial exclusion criterion:
Nursing female.

Annotated entities:
- Observation: "Nursing"
- Person: "female"